Clinical trial inclusion criterion:
a high cardiovascular risk and LDL-cholesterol> 2.5 mmol / l

Annotated entities:
- Condition: "cardiovascular risk"
- Qualifier: "high"
- Measurement: "LDL-cholesterol"
- Value: "> 2.5 mmol / l"